下列敘述何者與血液中甲狀腺素結合球蛋白（thyroxine binding globulin）無關？
A. 甲狀腺經切除一週後，血中仍可存在約 50%正常量之甲狀腺素（T4）
B. 短時間內投與正常人超過每日所需量之甲狀腺素，並不影響其血中游離甲狀腺素（free T4）值
C. 感染時可在局部組織提供高碘濃度環境
D. 可攜帶甲狀腺素進入中樞神經

正確答案：D. 可攜帶甲狀腺素進入中樞神經